de Quervain's disease 是指那兩條肌腱在腕部發生發炎病變？
A. 外展拇長肌腱及伸拇短肌腱
B. 屈指長肌腱及伸拇短肌腱
C. 屈指長肌腱及外展拇長肌腱
D. 外展拇長肌腱及伸指長肌腱

正確答案：A. 外展拇長肌腱及伸拇短肌腱